Clinical trial exclusion criterion:
Positive urine drug screening test

Entity relations:
- Has_value("urine drug screening test", "Positive")